Clinical trial exclusion criterion:
6. Is highly exuding (i.e. requires daily change of dressing)

Entity relations:
- Subsumes("highly exuding", "change of dressing")
- Has_multiplier("change of dressing", "daily")